Clinical trial exclusion criteria:
choroidal neovascularization caused by other eye diseases
ocular surgery within the past 3 mouths
history of uveitis
intraocular pressure higher than 25 mmHg, or glaucoma
history of systemic or ocular thromboembolic events.

Annotated entities:
- Condition: "choroidal neovascularization"
- Condition: "other eye diseases"
- Qualifier: "other"
- Procedure: "ocular surgery"
- Temporal: "within the past 3 mouths"
- Condition: "uveitis"
- Temporal: "history"
- Measurement: "intraocular pressure"
- Value: "higher than 25 mmHg"
- Condition: "glaucoma"
- Condition: "thromboembolic events"
- Qualifier: "ocular"
- Qualifier: "systemic"